Clinical trial inclusion criterion:
Eastern Cooperative Oncology Group (ECOG) performance status and/or other performance status 0, 1, or 2 at time of enrollment.

Entity relations:
- Has_value("Eastern Cooperative Oncology Group (ECOG) performance status", "0, 1, or 2")
- Has_temporal("Eastern Cooperative Oncology Group (ECOG) performance status", "at time of enrollment")